dilated cardiomyopathy due to valvular heart disease, hypertensive heart disease, history of myocarditis (no active myocardial infection present)

The above is a clinical trial inclusion criterion. Annotated with entity spans:
[Condition: dilated cardiomyopathy] due to [Condition: valvular heart disease], [Condition: hypertensive heart disease], [Temporal: history] of [Condition: myocarditis] ([Negation: no] [Temporal: active] [Condition: myocardial infection] present)